Clinical trial inclusion criterion:
Performance status of 0-1

Annotated entities:
- Measurement: "Performance status"
- Value: "0-1"